目前常用於治療子宮內膜異位症的方式，不包括下列那一項？
A. 給予 progestin
B. 給予 danazol
C. 腹腔鏡手術
D. 給予 dexamethasone

正確答案：D. 給予 dexamethasone